用手指敲耳前方時引起顏面肌肉抽動（twitching），最可能是那一種異常？
A. 血鉀過高
B. 血鈉過低
C. 血鈣過低
D. 血磷過低

正確答案：C. 血鈣過低